What are the features of the AESOP syndrome?

Adenopathy and Extensive Skin Patch Overlying a Plasmacytoma is defined as the AESOP Syndrome.